依據優生保健法的規定，懷孕婦女經診斷或證明有下列情事之一者，得依其自願，施行人工流產。下列何者正確？①本人或其配偶患有礙優生之遺傳性、傳染性疾病或精神疾病者 ②有醫學上理由，足以認定懷孕或分娩有招致生命危險或危害身體或精神健康者 ③有醫學上理由，足以認定胎兒有畸型發育之虞者 ④因懷孕或生產將影響其心理健康或家庭生活者
A. 僅①②③
B. 僅①③
C. 僅②④
D. ①②③④

正確答案：D. ①②③④